甲狀腺癌中發展緩慢，比較容易由淋巴轉移，預後良好，好發於年齡層較低的是以下那一種癌？
A. 濾胞癌（Follicular carcinoma）
B. 乳突癌（Papillary carcinoma）
C. 髓質癌（Medullary carcinoma）
D. 未分化癌（Anaplastic carcinoma）

正確答案：B. 乳突癌（Papillary carcinoma）